La regulación enzimática por fosforilación:
1. Es reversible.
2. Requiere de enzimas que introducen directamente el Pi.
3. Introduce el Pi en aminoácidos ácidos y básicos.
4. Siempre activa enzimas.
5. La llevan a cabo fosfatasas.

Respuesta correcta: 1. Es reversible.